Clinical trial exclusion criterion:
Known hepatic or renal impairment.

Entity relations:
- OR("hepatic impairment", "renal impairment")